either loco-regional or lymph node metastasis

The above is a clinical trial inclusion criterion. Annotated with entity spans:
either [Condition: loco-regional] or [Condition: lymph node metastasis]